胰臟惡性腫瘤常和家族性的遺傳疾病有關，但下列何種疾病除外？
A. hereditary nonpolyposis colon cancer
B. familial thyroid cancer
C. Peutz-Jeghers syndrome
D. ataxia-telangiectasia

正確答案：B. familial thyroid cancer